Clinical trial inclusion criterion:
Have Chronic HCV infection prior to transplantation with documented HCV viremia = 1,000 IU/ml at screening and either documented HCV Ab positivity or HCV viremia = 1,000 IU/ml at least 6 months prior to enrollment.

Entity relations:
- Has_temporal("Chronic HCV infection", "prior to transplantation")
- Has_index("prior to transplantation", "transplantation")
- Has_value("HCV viremia", "= 1,000 IU/ml")
- Has_value("HCV Ab", "positivity")
- Has_value("HCV viremia", "= 1,000 IU/ml")
- Has_temporal("HCV Ab", "at least 6 months prior to enrollment.")
- Has_index("at least 6 months prior to enrollment.", "enrollment")
- AND("Chronic HCV infection", "HCV viremia")
- AND("Chronic HCV infection", "HCV Ab")
- OR("HCV Ab", "HCV viremia")